孕期第三期時無痛性的陰道出血最有可能的原因是？
A. 胎盤早期剝離
B. 前置胎盤
C. 早產
D. 流產

正確答案：B. 前置胎盤